Clinical trial exclusion criterion:
Use of strong CYP3A4/P-glycoprotein inhibitors (specifically ritonavir, ketoconazole, clarithromycin, cyclosporine, diltiazem and verapamil)

Annotated entities:
- Drug: "strong CYP3A4/P-glycoprotein inhibitors"
- Drug: "ritonavir"
- Drug: "ketoconazole"
- Drug: "clarithromycin"
- Drug: "cyclosporine"
- Drug: "diltiazem"
- Drug: "verapamil"